Clinical trial exclusion criterion:
Individuals with a history of malignancy are ineligible except for the following circumstances. Individuals with a history of malignancy are eligible if they have been disease-free for at least 5 years and are deemed by the investigator to be at low risk for recurrence of that malignancy. Individuals with the following cancer are eligible if diagnosed and adequately treated within the past 5 years: cervical or breast cancer in situ, and basal cell or squamous cell carcinoma of the skin

Entity relations:
- Has_temporal("malignancy", "history")
- multi("recurrence of that malignancy", "that malignancy")
- Has_mood("recurrence of that malignancy", "low risk")
- Has_qualifier("treated", "adequately")
- Has_temporal("treated", "within the past 5 years")
- OR("cervical cancer in situ", "squamous cell carcinoma of the skin", "breast cancer in situ", "basal cell carcinoma of the skin")